Entre las técnicas más utilizadas en la Terapia Cognitiva de Beck para identificar o detectar esquemas cognitivos se encuentra:
1. La técnica de la flecha descendente.
2. El promover una nueva imagen.
3. La repetición de metas.
4. Las autoinstrucciones.
5. El experimento conductual.

Respuesta correcta: 1. La técnica de la flecha descendente.